Clinical trial inclusion criterion:
Participants must have at least one symptom per month in the month prior to enrollment

Annotated entities:
- Condition: "symptom"
- Multiplier: "at least one per month"
- Temporal: "in the month prior to enrollment"
- Reference_point: "to enrollment"